successful angioplasty (residual stenosis < 30%) on a significant stenosis (maximal systolic speed 3 times > from basal maximal systolic speed, stenosis > 70% on angiography) on the venous-prosthesis anastomosis or on the venous segment 5 cm after the anastomosis of a prosthetic haemodialysis vascular access (at least 1 month old)

The above is a clinical trial inclusion criterion. Annotated with entity spans:
[Qualifier: successful] angioplasty ([Measurement: residual stenosis] [Value: < 30%]) on a [Qualifier: significant] [Condition: stenosis] ([Measurement: maximal systolic speed] [Value: 3 times > from basal] maximal systolic speed, [Measurement: stenosis] [Value: > 70%] on [Procedure: angiography]) [Procedure: on the venous-prosthesis anastomosis] or [Procedure: on the venous segment 5 cm after the anastomosis] of a prosthetic haemodialysis vascular access (at least 1 month old)